Clinical trial exclusion criterion:
Subjects with kidney disease (except kidney stones).

Entity relations:
- Has_negation("kidney stones", "except")